Clinical trial inclusion criterion:
Have a T score between -1 and -2.49 at the femoral neck, total hip, or L1-L4 spine

Annotated entities:
- Measurement: "T score"
- Temporal: "between -1 and -2.49"
- Qualifier: "femoral neck"
- Qualifier: "total hip"
- Qualifier: "L1-L4 spine"